Which CDK targets control cytokinesis?

Aip1, Ede1 and Inn1 are CDK targets whose dephosphorylation is required for cytokinesis.